Clinical trial exclusion criterion:
Patients with clinically significant cardiovascular, renal, hepatic, endocrine disease, cancer or diabetes

Annotated entities:
- Condition: "cardiovascular disease"
- Condition: "renal disease"
- Condition: "hepatic disease"
- Condition: "endocrine disease"
- Condition: "cancer"
- Condition: "diabetes"
- Qualifier: "significant"